Clinical trial inclusion criterion:
successful left atrial appendage occlusion with Amulet device within 37 days prior to randomization.

Entity relations:
- Has_qualifier("left atrial appendage occlusion", "successful")
- AND("left atrial appendage occlusion", "Amulet device")
- Has_temporal("left atrial appendage occlusion", "within 37 days prior to randomization")